Clinical trial exclusion criterion:
Children who are wards of the state, in foster care or police custody or detention will be excluded.

Entity relations:
- OR("wards of the state", "foster care", "police custody", "detention")